下列藥物之中樞鎮靜作用可被flumazenil拮抗，何者為誤？
A. zolpidem
B. lorazapam
C. alcohol
D. aplrazolam

正確答案：C. alcohol